胸部電腦斷層發現毛玻璃狀病灶（ground glass opacity, GGO），有關其臨床意義的敘述，下列何者錯誤？
A. 有可能是早期adenocarcinoma
B. 有可能是atypical adenomatous hyperplasia
C. 如果是solid GGO，很可能是慢性發炎，定期追蹤即可
D. 有可能是肺腺癌的前身，應積極正確診斷

正確答案：C. 如果是solid GGO，很可能是慢性發炎，定期追蹤即可